Clinical trial exclusion criterion:
Patients that are high risk for moderate exercise based on ACSM risk classification.

Entity relations:
- Subsumes("risk for moderate exercise", "ACSM risk classification")
- Has_value("risk for moderate exercise", "high")